Una de las siguientes respuestas es FALSA respecto al cáncer de mama.
1. La mayoría de los tumores (70%) tienen receptores para hormonas.
2. El estadio medido según el sistema TNM es uno de los factores pronóstico de la enfermedad.
3. La presencia de adenopatías axilares contraindica la cirugía de la mama.
4. Las antraciclinas y los taxanos son los quimioterápicos más empleados en el tratamiento complementario.
5. La cirugía conservadora de la mama asociada a la radioterapia tiene resultados comparables a la mastectomía.

Respuesta correcta: 3. La presencia de adenopatías axilares contraindica la cirugía de la mama.